下列何者不是安非他命的戒斷症狀？
A. 嗜睡
B. 聽幻覺
C. 情緒低落
D. 飢餓感

正確答案：B. 聽幻覺